Clinical trial exclusion criterion:
current use of sedatives or antidepressant.

Entity relations:
- Has_temporal("sedatives", "current")
- OR("sedatives", "antidepressant")